Clinical trial exclusion criterion:
previous operation of tongue

Annotated entities:
- Temporal: "previous"
- Procedure: "operation of tongue"